正常的陰道菌落（vaginal flora）以下列何種情況最常見？
A. aerobic, pH 值低於 4.5
B. anaerobic, pH 值低於 4.5
C. anaerobic, pH 值高於 4.5
D. aerobic 與 anaerobic 均有，pH 值高於 4.5

正確答案：A. aerobic, pH 值低於 4.5